Clinical trial exclusion criterion:
Combined P-glycoprotein and moderate CYP 3A4 inhibitor

Annotated entities:
- Drug: "P-glycoprotein inhibitor"
- Drug: "CYP 3A4 inhibitor"
- Qualifier: "moderate"